Adult outpatients (18 years or older)

The above is a clinical trial inclusion criterion. Annotated with entity spans:
[Person: Adult] [Visit: outpatients] ([Value: 18 years or older])